What is the basis of the BLISS technique?

bliss is a versatile and quantitative method for genome-wide profiling of dna double-strand breaks